Clinical trial exclusion criterion:
Patients with chronic pain requiring treatment, with a known allergy to paracetamol, or concomitant use of non-steroidal anti-inflammatories , oral anticoagulants or corticosteroids.

Entity relations:
- Has_qualifier("chronic pain", "requiring treatment")
- AND("known allergy", "paracetamol")
- Has_temporal("non-steroidal anti-inflammatories", "concomitant")
- OR("non-steroidal anti-inflammatories", "oral anticoagulants", "corticosteroids")
- OR("known allergy", "non-steroidal anti-inflammatories")